¿Por qué en las madres lactantes no aparecen los ciclos ováricos durante varios meses tras el parto?:
1. Por el estrés y la falta de sueño asociados a la lactancia.
2. Porque existen niveles bajos de FSH y LH.
3. Porque existen niveles altos de oxitocina.
4. Por ahorro de hierro que se deriva de la lactancia.
5. Porque existen niveles altos de progesterona.

Respuesta correcta: 2. Porque existen niveles bajos de FSH y LH.